Clinical trial exclusion criterion:
The existence of intra-cardiac thrombus on trans-esophageal echocardiography

Entity relations:
- AND("trans-esophageal echocardiography", "intra-cardiac thrombus")